Clinical trial exclusion criterion:
Known or suspected congenital or acquired immunodeficiency; or receipt of immunosuppressive therapy, such as anti-cancer chemotherapy or radiation therapy, within the preceding 6 months; or long-term systemic corticosteroid therapy (prednisone or equivalent for more than 2 consecutive weeks within the past 3 months)

Annotated entities:
- Condition: "acquired immunodeficiency"
- Condition: "congenital immunodeficiency"
- Procedure: "immunosuppressive therapy"
- Procedure: "anti-cancer chemotherapy"
- Procedure: "radiation therapy"
- Temporal: "within the preceding 6 months"
- Procedure: "systemic corticosteroid therapy"
- Multiplier: "long-term"
- Drug: "prednisone"
- Temporal: "for more than 2 consecutive weeks"
- Temporal: "within the past 3 months"
- Observation: "suspected"
- Observation: "Known"